¿Qué estima la medición de los pliegues cutáneos?:
1. La masa corporal.
2. La grasa corporal total.
3. La masa magra.
4. La relación entre masa grasa y masa muscular.
5. La masa libre de grasa.

Respuesta correcta: 2. La grasa corporal total.